Absence of documentation of negative hepatitis B serologies, absence of completion of treatment for chronic hepatitis B, or absence of suppressive antiviral treatment

The above is a clinical trial exclusion criterion. Annotated with entity spans:
[Negation: Absence of] documentation of [Value: negative] [Measurement: hepatitis B serologies], [Negation: absence of] [Non-representable: completion of] [Procedure: treatment] for [Condition: chronic hepatitis B], or [Negation: absence] of [Procedure: suppressive antiviral treatment]